What datasets are available related to Duchenne Muscular Dystrophy?

MD STARnet, ImagingDMD and PRO-DMD-01 are some of the available DMD datasets.